Completed the initial routine ante-natal examination at the clinics

The above is a clinical trial inclusion criterion. Annotated with entity spans:
Completed the initial [Condition: routine ante-natal examination] at the [Visit: clinics]